30歲女性，月經周期規則，根據她最後一次月經來計算，目前懷孕10週，關於胎兒生長發育的敘述，下列何者最不符合？
A. 手肘可彎曲
B. 頭臀徑（crown-rump length）7公分
C. 橫膈膜已形成
D. 心臟結構已形成

正確答案：B. 頭臀徑（crown-rump length）7公分